Clinical trial exclusion criterion:
Subject with a history of malignancy within the past 5 years (other than squamous or basal cell skin cancer)

Annotated entities:
- Temporal: "history of"
- Condition: "malignancy"
- Temporal: "within the past 5 years"
- Negation: "other than"
- Condition: "squamous skin cancer"
- Condition: "basal cell skin cancer"